Clinical trial exclusion criterion:
Suspected, or known addiction to or abuse of illicit drug(s), prescription medicine(s), or alcohol within the past 2 years.

Entity relations:
- Has_temporal("addiction", "past 2 years")
- Has_qualifier("addiction", "illicit drug")
- OR("addiction", "abuse")
- OR("illicit drug", "prescription medicine", "alcohol")